Clinical trial exclusion criterion:
15. Idiopathic epilepsy and anti-epileptic treatment.

Annotated entities:
- Parsing_Error: "15."
- Condition: "Idiopathic epilepsy"
- Condition: "anti-epileptic treatment"